En el colágeno, ¿cuál es el aminoácido que se repite siempre cada tres residuos?
1. Glicina.
2. Alanina.
3. Prolina.
4. Lisina.
5. Hidroxiprolina.

Respuesta correcta: 1. Glicina.